What is CRAO in the context of the eye?

central retinal artery occlusion (CRAO)